Clinical trial exclusion criterion:
uncontrolled diabetes mellitus type 2 with fasting glucose > 13.3 mmol/l confirmed on a second day

Entity relations:
- Has_qualifier("diabetes mellitus type 2", "uncontrolled")
- Has_value("fasting glucose", "> 13.3 mmol/l")
- AND("diabetes mellitus type 2", "fasting glucose")